關於針對核苷酸合成路徑所設計的藥物，下列敘述何者錯誤？
A. azaserine 會抑制 glutamine amidotransferase，無法提供核苷酸合成所需要的氮基
B. fluorouracil 會抑制 thymidylate kinase
C. methotrexate 會抑制 dihydrofolate reductase
D. trimethoprim 對細菌 dihydrofolate reductase 的親和力比對人類相對應的酵素還要高十萬倍

正確答案：B. fluorouracil 會抑制 thymidylate kinase